下列何者不屬於消化道的內在神經系統（intrinsic nervous system）？
A. interstitial cell of Cajal（ICC）
B. myenteric plexus
C. nodose ganglion
D. submucosal plexus

正確答案：C. nodose ganglion